Clinical trial exclusion criterion:
Use of antidepressant medication within 1 month of the pre-treatment PET scan (within 5 weeks for fluoxetine and protryptyline).

Entity relations:
- Has_index("within 1 month of the pre-treatment PET scan", "pre-treatment PET scan")
- Has_temporal("antidepressant medication", "within 1 month of the pre-treatment PET scan")
- Has_index("within 5 weeks for fluoxetine and protryptyline", "fluoxetine and protryptyline")
- Has_temporal("antidepressant medication", "within 5 weeks for fluoxetine and protryptyline")
- multi("pre-treatment PET scan", "PET scan")
- multi("fluoxetine and protryptyline", "fluoxetine")
- multi("fluoxetine and protryptyline", "protryptyline")
- Has_temporal("PET scan", "pre-treatment")